Clinical trial exclusion criterion:
Patients who exceed minimal physical activity recommendations from the US Surgeon General's Report: Accumulation of 30 minutes or more of moderate physical activity on most days of the week.

Annotated entities:
- Observation: "exceed minimal physical activity recommendations"
- Non-query-able: "Patients who exceed minimal physical activity recommendations from the US Surgeon General's Report: Accumulation of 30 minutes or more of moderate physical activity on most days of the week."